Clinical trial exclusion criterion:
4. WHO clinical classification Groups 2-5

Entity relations:
- Has_value("WHO clinical classification", "Groups 2-5")